Clinical trial inclusion criterion:
No allergies to any test foods

Entity relations:
- Has_negation("allergies", "No")
- Has_context("allergies", "test foods")